Clinical trial exclusion criterion:
Severely or morbidly obese or higher obesity classification (BMI =36)

Entity relations:
- Has_qualifier("obese", "morbidly")
- Has_qualifier("obese", "Severely")
- Has_value("BMI", "=36")
- OR("obese", "higher obesity classification", "BMI")